with the diagnosis of sepsis (as specified below) within the previous 24 hours

The above is a clinical trial inclusion criterion. Annotated with entity spans:
with the diagnosis of [Condition: sepsis] (as specified below) [Temporal: within the previous 24 hours]